Clinical trial inclusion criterion:
Stage I (140-159/90-99 mmHg) untreated subjects with essential hypertension

Annotated entities:
- Condition: "essential hypertension"
- Qualifier: "Stage I"
- Qualifier: "untreated"